¿Qué ventajas tienen los inventarios empleados habitualmente en evaluación infantil?
1. Proporcionan puntuaciones estandarizadas y reducen los costes de evaluación.
2. Facilitan la obtención de información detallada sobre el problema.
3. Proporcionan eneatipos.
4. Permiten recabar información de distintas áreas relacionadas con el problema actual.
5. Pueden ser aplicados tanto a los adultos como a los niños.

Respuesta correcta: 1. Proporcionan puntuaciones estandarizadas y reducen los costes de evaluación.